下列何者不受腰神經叢（lumbar plexus）受損影響？
A. 腹橫肌（transversus abdominis muscle）
B. 提睪肌（cremaster muscle）
C. 肉膜肌（dartos muscle）
D. 閉孔外肌（obturator externus）

正確答案：C. 肉膜肌（dartos muscle）